一位患者因為跌倒造成手肘脫臼，石膏固定期間，應該進行相關活動，何者不包括在內？
A. 每日做肩關節主動活動運動，避免肩關節攣縮
B. 每日電刺激三角肌，避免該肌肉萎縮
C. 每日作二頭肌、三頭肌等長肌肉收縮運動
D. 經常做主動性手腕及手指各方向的運動

正確答案：B. 每日電刺激三角肌，避免該肌肉萎縮